Clinical trial exclusion criterion:
Mean arterial pressure less than 55 mmHg despite appropriate fluid resuscitation and vasopressor support.

Entity relations:
- Has_value("Mean arterial pressure", "less than 55 mmHg")